下列那一項無法作為細菌行無氧呼吸（anaerobic respiration）時之最後的電子接受分子？
A. Nitrate
B. Sulfate
C. Carbon dioxide
D. NADH

正確答案：D. NADH